Which disease phenotype has the worst prognosis in Duchenne Muscular Dystrophy?

Dp140 isoform is related to increased risk of cognitive impairment and thus worse prognosis.